Clinical trial inclusion criterion:
Documented genotype 1 HCV infection prior to enrollment and after their transplant in the post-transplantation cohort

Annotated entities:
- Qualifier: "genotype 1"
- Condition: "HCV infection"
- Temporal: "prior to enrollment"
- Temporal: "after their transplant i"
- Reference_point: "enrollment"
- Reference_point: "transplant"